下列何者不是衍生自耳板（otic placode）？
A. 耳蝸管（cochlear duct）
B. 螺旋神經節（spiral ganglion）
C. 半規管（semicircular duct）
D. 耳囊（otic capsule）

正確答案：D. 耳囊（otic capsule）